Clinical trial exclusion criterion:
6. Currently taking other medications thought to have an impact on immune system functioning, i.e., chemotherapeutic agents.

Annotated entities:
- Drug: "chemotherapeutic agents"
- Undefined_semantics: "chemotherapeutic agents"
- Temporal: "Currently"
- Qualifier: "other"
- Drug: "medications"
- Qualifier: "impact on immune system functioning"